Clinical trial exclusion criterion:
Chronic total occlusion (CTO) lesions, in-stent restenosis (ISR)

Entity relations:
- Subsumes("Chronic total occlusion", "CTO")
- Subsumes("in-stent restenosis", "ISR")
- OR("Chronic total occlusion", "in-stent restenosis")